Clinical trial exclusion criterion:
Subjects for whom a single dose of 1.0 milligram (mg) dexamethasone acetate may be contraindicated

Annotated entities:
- Multiplier: "single"
- Multiplier: "dose of 1.0 milligram (mg)"
- Drug: "dexamethasone acetate"
- Condition: "contraindicated"